Clinical trial exclusion criterion:
Use of pain medication (except paracetamol) within 3 days

Annotated entities:
- Drug: "pain medication"
- Negation: "except"
- Drug: "paracetamol"
- Temporal: "within 3 days"